Clinical trial inclusion criteria:
F; age 18 to 70
American Society of Anesthesiologists (ASA) I e II;
breast cancer ( DIN 2 e 3, o LIN 2 e 3 sec. Tavassoli) scheduled for nipple-sparing mastectomy, simple mastectomy, skin-sparing mastectomy, skin-reducing mastectomy c, lymphnode biopsy and axillary dissection;
immediate sub-pectoral prosthetic reconstruction;
signed informed consent.

Annotated entities:
- Person: "F"
- Person: "age"
- Value: "18 to 70"
- Measurement: "American Society of Anesthesiologists (ASA)"
- Value: "I e II"
- Condition: "breast cancer"
- Measurement: "DIN"
- Value: "2 e 3"
- Measurement: "LIN"
- Value: "2 e 3 sec"
- Condition: "nipple-sparing mastectomy"
- Mood: "scheduled for"
- Condition: "simple mastectomy"
- Condition: "skin-sparing mastectomy"
- Condition: "skin-reducing mastectomy"
- Condition: "lymphnode biopsy"
- Condition: "axillary dissection"
- Procedure: "sub-pectoral prosthetic reconstruction"
- Qualifier: "immediate"
- Non-query-able: "signed informed consent"